Clinical trial inclusion criterion:
6-min walk of > 50m (without rehabilitation) or > 100m (with rehabilitation)

Entity relations:
- Has_qualifier("> 100m", "rehabilitation")
- Has_negation("rehabilitation", "without")
- Has_qualifier("> 50m", "rehabilitation")
- Has_value("6-min walk", "> 50m")
- OR("> 50m", "> 100m")